Clinical trial exclusion criteria:
Diabetes mellitus or plasma glucose >11,1 at admission.
Receiving steroids at the time of transplantation or likely to need steroids after transplantation.
Multiorgan transplants and/or previously transplanted with any other organ than kidney.
Panel reacting antibodies(PRA) >25% in most recent test or considered to be of high risk for rejection which requires an enhanced immunosuppression.
Renal transplants from HLA-identical sibling.
Hypersensitivity to, or disability to take immunosuppressive drugs.
Blood group(ABO)-incompatible transplants.
Unlikely to comply with the study requirements.
Transplant from donor positive for HIV, HBsAg, Hepatitis C.
Female of childbearing potential planing/being pregnant or unwilling to use contraception.

Annotated entities:
- Condition: "Diabetes mellitus"
- Measurement: "plasma glucose"
- Value: ">11,1"
- Temporal: "at admission"
- Drug: "steroids"
- Procedure: "Receiving"
- Temporal: "at the time of transplantation"
- Reference_point: "transplantation"
- Mood: "likely to need"
- Drug: "steroids"
- Temporal: "after transplantation"
- Reference_point: "transplantation"
- Procedure: "Multiorgan transplants"
- Temporal: "previously"
- Procedure: "transplanted with any other organ than kidney"
- Measurement: "Panel reacting antibodies(PRA)"
- Value: ">25%"
- Temporal: "most recent test"
- Mood: "considered to be of high risk"
- Condition: "rejection"
- Procedure: "enhanced immunosuppression"
- Procedure: "Renal transplants"
- Qualifier: "HLA-identical sibling"
- Condition: "Hypersensitivity"
- Condition: "disability"
- Drug: "immunosuppressive drugs"
- Qualifier: "Blood group(ABO)-incompatible"
- Procedure: "transplants"
- Non-query-able: "Unlikely to comply with the study requirements."
- Condition: "positive for HIV"
- Condition: "positive for HBsAg"
- Condition: "positive for Hepatitis C"
- Procedure: "Transplant"
- Qualifier: "donor"
- Pregnancy_considerations: "Female of childbearing potential planing/being pregnant or unwilling to use contraception."